En el trastorno de personalidad límite, el tratamiento que mayor evidencia empírica ha recibido es:
1. La terapia cognitiva basada en los esquemas.
2. La terapia centrada en el cliente.
3. La terapia interpersonal.
4. La terapia de conducta.

Respuesta correcta: 4. La terapia de conducta.